Clinical trial exclusion criterion:
Any other variety of LAL

Entity relations:
- Has_qualifier("LAL", "other variety")